Clinical trial exclusion criterion:
Any metabolic disorders or other diseases that may impact on normal growth patterns.

Annotated entities:
- Condition: "metabolic disorders"
- Qualifier: "may impact on normal growth patterns"
- Subjective_judgement: "may impact on normal growth patterns"
- Undefined_semantics: "may impact on normal growth patterns"
- Condition: "other diseases"